Clinical trial inclusion criterion:
Routine blood test:WBC=3.0×109/L,Neutrophils=1.5×109/L,Hb=100g/L,Platelet=80×109/L; LVEF=50%;

Annotated entities:
- Measurement: "test:WBC"
- Value: "=3.0×109/L"
- Measurement: "Neutrophils"
- Value: "=1.5×109/L"
- Measurement: "Hb"
- Value: "=100g/L"
- Measurement: "Platelet"
- Value: "=80×109/L"
- Measurement: "LVEF"
- Value: "=50%"